Clinical trial exclusion criterion:
Known allergy/sensitivity or any hypersensitivity to components of study drugs or their formulation.

Annotated entities:
- Condition: "allergy"
- Condition: "sensitivity"
- Condition: "hypersensitivity"
- Drug: "components of study drugs"